Clinical trial exclusion criterion:
History of a severe seizure disorder or current anticonvulsant use.

Annotated entities:
- Qualifier: "severe"
- Condition: "seizure disorder"
- Drug: "anticonvulsant"
- Temporal: "current"